Clinical trial exclusion criterion:
Oral anticoagulation with International Normalized Ratio (INR) > 2

Entity relations:
- Has_value("International Normalized Ratio (INR)", "> 2")